Severe or uncontrolled hypertension [resting Systolic Blood Pressure (SBP) >180 millimeters of mercury (mmHg), or resting Diastolic Blood Pressure (DBP) >110mmHg at screening period].

The above is a clinical trial exclusion criterion. Annotated with entity spans:
[Qualifier: Severe] or [Qualifier: uncontrolled] [Condition: hypertension] [[Qualifier: resting] [Measurement: Systolic Blood Pressure] ([Measurement: SBP]) [Value: >180 millimeters of mercury] (mmHg), or [Qualifier: resting] [Measurement: Diastolic Blood Pressure] ([Measurement: DBP]) [Value: >110mmHg] [Temporal: at screening period]].